下列治療類風濕性關節炎的藥物中，那一種的作用主要是抑制嘧啶（pyrimidine）的合成？
A. Leflunomide
B. Cyclosporine
C. Hydroxychloroquine
D. Sulfasalazine

正確答案：A. Leflunomide